Kidney transplant recipients at Washington University/Barnes-Jewish Hospital

The above is a clinical trial inclusion criterion. Annotated with entity spans:
[Procedure: Kidney transplant] recipients at [Visit: Washington University/Barnes-Jewish Hospital]